Clinical trial inclusion criterion:
Age: > or = 16 years

Annotated entities:
- Person: "Age"
- Value: "> or = 16 years"